Clinical trial exclusion criterion:
Myocardial infarction within the previous 6 months

Annotated entities:
- Condition: "Myocardial infarction"
- Temporal: "within the previous 6 months"